Clinical trial inclusion criterion:
Healthy pregnant women age 18 to 50

Entity relations:
- Has_value("age", "18 to 50")